Clinical trial exclusion criterion:
Greater than 12 months from spinal cord injury

Annotated entities:
- Condition: "spinal cord injury"
- Temporal: "Greater than 12 months"